History of cognitive impairment or dysfunction, including a history of dementia, Alzheimer's disease, stroke with residual cognitive deficits, cognitive dysfunction related to alcohol or substance abuse, or cognitive dysfunction related to prior treatment for any cancer.

The above is a clinical trial exclusion criterion. Annotated with entity spans:
History of [Condition: cognitive impairment] or dysfunction, including a history of [Condition: dementia], [Condition: Alzheimer's disease], [Condition: stroke] with [Condition: residual cognitive deficits], [Condition: cognitive dysfunction] related to [Condition: alcohol] or [Condition: substance abuse], or [Condition: cognitive dysfunction] related to [Temporal: prior] [Procedure: treatment] for [Qualifier: any] [Condition: cancer].